Clinical trial inclusion criterion:
imaging findings of degenerative changes of the joint (osteoarthritis or chondropathy with Kellgren Lawrence Score from 0 to 3 at X-ray evaluation).

Annotated entities:
- Procedure: "imaging"
- Condition: "degenerative changes"
- Condition: "osteoarthritis"
- Condition: "chondropathy"
- Measurement: "Kellgren Lawrence Score"
- Value: "from 0 to 3"
- Procedure: "X-ray"